Teeth with signs and symptoms of reversible pulpitis

The above is a clinical trial inclusion criterion. Annotated with entity spans:
[Qualifier: Teeth] with signs and symptoms of [Condition: reversible pulpitis]